¿Qué velocidad de perfusión de un fármaco deberías administrar para conseguir una concentración de equilibrio en plasma de 10 mg/L sabiendo que presenta un aclaramiento plasmático de 500 mL/h? (perfusión continua):
1. 50 mg/h.
2. 5 mL/h.
3. 100 mg/h.
4. 100 mg/mL.
5. 5 mg/h.

Respuesta correcta: 5. 5 mg/h.